脾靜脈竇（splenic sinuses）的管壁內襯主要由下列那種細胞構成？
A. 巨噬細胞（macrophages）
B. 桿狀內皮細胞（rod-shaped endothelial cells）
C. 纖維母細胞（fibroblasts）
D. 網狀細胞（ reticular cells）

正確答案：B. 桿狀內皮細胞（rod-shaped endothelial cells）